Clinical trial exclusion criterion:
Less than 50 kg of weight

Annotated entities:
- Value: "Less than 50 kg"
- Measurement: "weight"